Clinical trial inclusion criterion:
For women of childbearing potential, a negative pregnancy test is required during screening

Annotated entities:
- Person: "women"
- Observation: "childbearing potential"
- Value: "negative"
- Measurement: "pregnancy test"
- Temporal: "during screening"
- Reference_point: "screening"